下列何者是經過枕三角（occipital triangle）的重要構造？
A. 鎖骨下動脈（subclavian artery）
B. 脊髓副神經（spinal accessory nerve）
C. 迷走神經（vagus nerve）
D. 內頸靜脈（internal jugular vein）

正確答案：B. 脊髓副神經（spinal accessory nerve）